Clinical trial exclusion criterion:
Patients with severe uncontrolled hypertension with systolic BP > 220mmHg or diastolic BP > 120mmHg;

Annotated entities:
- Condition: "hypertension"
- Qualifier: "uncontrolled"
- Qualifier: "severe"
- Measurement: "systolic BP"
- Value: "> 220mmHg"
- Measurement: "diastolic BP"
- Value: "> 120mmHg"